Clinical trial inclusion criterion:
Heart rate >110 beats/min

Annotated entities:
- Measurement: "Heart rate"
- Value: ">110 beats/min"